Primary tumor must have been diagnosed histologically as either epithelial ovarian cancer, fallopian tube cancer, or primary peritoneal cancer (not borderline or low malignant potential epithelial carcinoma).

The above is a clinical trial inclusion criterion. Annotated with entity spans:
[Qualifier: Primary tumor] must have been diagnosed [Procedure: histologically] as either [Condition: epithelial ovarian cancer], [Condition: fallopian tube cancer], or [Condition: primary peritoneal cancer] ([Negation: not] [Qualifier: borderline] or [Qualifier: low malignant potential] [Condition: epithelial carcinoma]).